Clinical trial inclusion criterion:
Completion of 6 weeks of physical therapy program

Annotated entities:
- Procedure: "physical therapy program"
- Temporal: "6 weeks"